Clinical trial inclusion criterion:
Sufficient number of umbilical cord blood units available for transplantation

Entity relations:
- Has_value("umbilical cord blood units available", "Sufficient number")
- multi("for transplantation", "transplantation")
- Has_qualifier("umbilical cord blood units available", "for transplantation")